severe respiratory disease

The above is a clinical trial exclusion criterion. Annotated with entity spans:
[Qualifier: severe] [Condition: respiratory disease]